王小姐是一位憂鬱症患者，長期使用藥物治療。最近由於和男朋友吵架，情緒低落且失眠更為嚴重，數次向朋友表示要燒炭自殺，並買了一包炭回家。下列何者為最適當的處理方式？
A. 調整抗憂鬱藥物
B. 請家人多注意病人的行為
C. 詳細評估壓力來源
D. 轉介精神醫療院所住院治療

正確答案：D. 轉介精神醫療院所住院治療